Clinical trial exclusion criterion:
excessive thrombus (e.g. requires target vessel thrombectomy)

Annotated entities:
- Condition: "thrombus"
- Procedure: "target vessel thrombectomy"